Clinical trial exclusion criterion:
Magnetic metallic implants (such as screws, pins, shrapnel remnants, aneurysm clips, artificial heart valves, inner ear (cochlear) implants, artificial joints, and vascular stents)

Entity relations:
- Subsumes("inner ear implants", "cochlear implants")
- Subsumes("Magnetic metallic implants", "screws")
- OR("screws", "pins", "shrapnel remnants", "aneurysm clips", "artificial heart valves", "inner ear implants", "artificial joints", "vascular stents")